Patients who have had an operative procedure involving the eye, ear, or central nervous system within one month;

The above is a clinical trial exclusion criterion. Annotated with entity spans:
Patients who have had an [Procedure: operative procedure] involving the [Qualifier: eye], [Qualifier: ear], or [Qualifier: central nervous system] [Temporal: within one month];